Clinical trial exclusion criterion:
Clinically significant bleeding within the last 30 days.

Annotated entities:
- Qualifier: "Clinically significant"
- Condition: "bleeding"
- Temporal: "within the last 30 days"